Clinical trial inclusion criterion:
Subject has normal ECG parameters (QRS width in the 12 channel surface ECG =120 ms, QTc - interval < 440 ms, PQ - interval = 210 ms; all parameters should be measured at sinus rhythm).

Annotated entities:
- Procedure: "ECG"
- Value: "normal"
- Measurement: "QRS width"
- Qualifier: "12 channel surface ECG"
- Value: "=120 ms"
- Measurement: "QTc - interval"
- Value: "< 440 ms"
- Measurement: "PQ - interval"
- Value: "= 210 ms"
- Condition: "sinus rhythm"